Clinical trial exclusion criterion:
Congenital or organic bowel pathology

Annotated entities:
- Condition: "organic bowel pathology"
- Condition: "Congenital bowel pathology"